Los cuerpos cetónicos:
1. Incrementan su concentración en la sangre en condiciones de ayuno prolongado.
2. Se forman por eliminación de la CoA del correspondiente intermediario de la βoxidación.
3. Se sintetizan a partir de β-hidroxi β-metil glutaril-CoA (HMG-CoA) citoplasmático.
4. Se sintetizan en el tejido muscular, fundamentalmente, en el músculo esquelético.

Respuesta correcta: 1. Incrementan su concentración en la sangre en condiciones de ayuno prolongado.